Clinical trial inclusion criterion:
Low risk: Gleason <or=6 & PSA <or=10 & Clinical Stage T1b-T2a,Nx or N0, Mx or M0

Annotated entities:
- Measurement: "Gleason"
- Observation: "Low risk"
- Value: "<or=6"
- Measurement: "PSA"
- Value: "<or=10"
- Measurement: "Clinical Stage"
- Value: "T1b-T2a"
- Value: "Mx"
- Value: "M0"
- Value: "Nx"
- Value: "N0"